1. Menstruating females 10-19 years of age

The above is a clinical trial inclusion criterion. Annotated with entity spans:
1. [Condition: Menstruating] [Person: females] [Value: 10-19 years] of [Person: age]